Ischemic symptoms or evidence of myocardial ischemia (inducible or spontaneous) in the presence of >50% de novo stenosis located in native coronary vessels

The above is a clinical trial inclusion criterion. Annotated with entity spans:
[Condition: Ischemic symptoms] or [Mood: evidence] of [Condition: myocardial ischemia] ([Qualifier: inducible] or [Qualifier: spontaneous]) in the presence of [Value: >50%] [Qualifier: de novo] [Measurement: stenosis] located in [Qualifier: native coronary vessels]